Clinical trial exclusion criteria:
Evidence of sympathetic integrity below the lesion level by the skin axon-reflex vasodilatation (SkARV) test;
Known allergies to midodrine hydrochloride;
PMH of diagnosed heart, kidney, peripheral vascular, or cerebral vascular disease, or diabetes mellitus;
Hypertension (BP>140/90 mmHg);
Untreated thyroid disease;
Acute illness or infection;
Current smoker;
Pregnancy.

Annotated entities:
- Observation: "sympathetic integrity"
- Qualifier: "below the lesion level"
- Measurement: "test skin axon-reflex vasodilatation"
- Measurement: "SkARV"
- Condition: "allergies"
- Drug: "midodrine hydrochloride"
- Condition: "diabetes mellitus"
- Condition: "cerebral vascular disease"
- Condition: "peripheral vascular, disease"
- Condition: "kidney disease"
- Condition: "heart disease"
- Condition: "Hypertension"
- Measurement: "BP"
- Value: ">140/90 mmHg"
- Condition: "thyroid disease"
- Qualifier: "Untreated"
- Condition: "infection"
- Condition: "illness"
- Qualifier: "Acute"
- Person: "smoker"
- Condition: "Pregnancy"